Patients undergoing thoracic aorta surgery with hypothermic circulatory arrest, over 20-of age

The above is a clinical trial inclusion criterion. Annotated with entity spans:
Patients undergoing [Qualifier: thoracic aorta] [Procedure: surgery] with [Condition: hypothermic circulatory arrest], [Value: over 20]-of [Person: age]